Clinical trial inclusion criterion:
Moderate to very severe lesions located in large folds

Annotated entities:
- Condition: "lesions"
- Context_Error: "lesions"
- Qualifier: "very severe"
- Subjective_judgement: "very severe"
- Undefined_semantics: "very severe"